現在已知的肝炎病毒中，下列那一項敘述錯誤？
A. A型和E型傳染途徑為糞口傳染
B. A、C、D與E型之核酸均為RNA，唯有B型為部分雙股環狀（partially double-stranded
C. B和C型可導致慢性肝炎
D. D型肝炎需A型之幫助來傳染和複製

正確答案：D. D型肝炎需A型之幫助來傳染和複製